下列有關中樞神經興奮劑 methylphenidate 的敘述，何者錯誤？
A. 可以有效改善注意力不足/過動症候群（attention-deficit/hyperactivity syndrome）
B. 具有阻斷 norepinephrine 及 dopamine 被再吸收到突觸前神經元的作用
C. 具有促進食慾的作用
D. 不適合使用於心血管疾病病史的病人

正確答案：C. 具有促進食慾的作用